以免疫螢光法做抗核抗體（ANA）時，其結果除了濃度高低外，另能看出核染色之類型（pattern），下列那一種類型與全身性硬化症（systemic sclerosis）最具相關性？
A. Centromere pattern
B. Peripheral pattern
C. Cytoplasmic pattern
D. Homogenous pattern

正確答案：A. Centromere pattern